肝十二指腸韌帶（hepatoduodenal ligament）內不含下列何結構？
A. 肝鐮狀韌帶（falciform ligament）
B. 肝門靜脈
C. 肝動脈
D. 膽管（Bile duct）

正確答案：A. 肝鐮狀韌帶（falciform ligament）